¿Cuál de las siguientes NO es una característica de las conductas estereotipadas?:
1. Ser repetitiva y rítmica.
2. Ser invariable en topografía (manifestación física).
3. Ser rara y excesiva en frecuencia, tasa o amplitud.
4. Ser inconsistente y en todo caso inofensiva para el propio sujeto.

Respuesta correcta: 4. Ser inconsistente y en todo caso inofensiva para el propio sujeto.